Clinical trial inclusion criterion:
Adequate liver function - serum total bilirubin concentration less than 1.5 x upper limit of normal value

Annotated entities:
- Measurement: "liver function"
- Value: "Adequate"
- Measurement: "serum total bilirubin concentration"
- Value: "less than 1.5 x upper limit of normal value"